63歲的楊先生在車禍後送到急診，電腦斷層檢查為急性硬腦膜下出血，此時加護病房滿床，醫師檢視每一床的病歷，沒有找到可以轉出加護病房的病患，醫師考慮把楊先生留在急診暫留區，但知道照顧楊先生不是暫留區醫護人力能夠負荷，目前附近也找不到其他機構可代為收治這種隨時可能要手術的神經外科病患；此時醫師應如何處理最適當？
A. 將楊先生放在暫留區，也只能以現有的醫護人力照顧他
B. 請院方向政府提出地區層次資源分配問題
C. 聯絡值班行政人員，調度具相關能力的額外人員至急診給予楊先生暫時性照護
D. 每個病人都有平等競爭有限資源的機會，讓楊先生與加護病房病人們抽籤，抽到一位轉出加護病房

正確答案：C. 聯絡值班行政人員，調度具相關能力的額外人員至急診給予楊先生暫時性照護